有關何杰金氏淋巴瘤（Hodgkin lymphoma）的敘述，下列何者正確？
A. 整體來說，治療效果與存活率低於非何杰金氏淋巴瘤（non-Hodgkin lymphoma）
B. 大多數發生在淋巴結以外的器官
C. 典型腫瘤中，腫瘤細胞只占所有細胞的小部分
D. 病理亞型比臨床分期對存活率影響較大

正確答案：C. 典型腫瘤中，腫瘤細胞只占所有細胞的小部分